Willing and capable of providing informed consent

The above is a clinical trial inclusion criterion. Annotated with entity spans:
[Post-eligibility: Willing and capable of providing informed consent]